Clinical trial inclusion criteria:
Male or female = 2 years of age;
Have sickle cell disease (confirmed by Hb electrophoresis or more specific tests) or other conditions with iron overload from repeated blood transfusions (see exclusion criteria for exceptions);
Baseline LIC >7 mg/g dw (measured by MRI);
Patients who have received no less than 20 transfusions of RBCs;
Patients who have received at least 1 transfusion per year in the last 2 years and who are expected to have a continuing requirement (based on Investigator's judgement) during the duration of the trial

Annotated entities:
- Person: "Male"
- Person: "female"
- Value: "= 2 years"
- Person: "age"
- Condition: "sickle cell disease"
- Procedure: "Hb electrophoresis"
- Procedure: "more specific tests"
- Condition: "other conditions with iron overload"
- Multiplier: "repeated"
- Procedure: "blood transfusions"
- Measurement: "Baseline LIC"
- Value: ">7 mg/g"
- Procedure: "MRI"
- Multiplier: "no less than 20"
- Procedure: "transfusions of RBCs"
- Multiplier: "at least 1 per year"
- Temporal: "in the last 2 years"
- Procedure: "transfusion"
- Condition: "expected to have a continuing requirement"
- Temporal: "during the duration of the trial"